Clinical trial exclusion criterion:
4. Acute decompensated heart failure within 1 month of Screening.

Annotated entities:
- Parsing_Error: "4."
- Condition: "heart failure"
- Qualifier: "decompensated"
- Qualifier: "Acute"
- Temporal: "within 1 month of Screening"
- Reference_point: "Screening"